Debilitating stroke within 90 days before inclusion

The above is a clinical trial exclusion criterion. Annotated with entity spans:
[Condition: Debilitating] [Condition: stroke] [Temporal: within 90 days before inclusion]